Which algorithm has been developed for the automatic extraction of co-expressed gene clusters from gene expression data?

Clust is a method for automatic extraction of optimal co-expressed gene clusters from gene expression data. Clust is available at https://github.com/BaselAbujamous/clust.